Un paciente ex fumador, diagnosticado previamente de EPOC acude a revisión. En la exploración física se detecta la existencia de hipocratismo digital de aparición reciente. ¿Cuál es la explicación más aceptable para este hallazgo en el contexto clínico que se describe?
1. Carcinoma pulmonar.
2. Bronquiectasias.
3. Fibrosis pulmonar.
4. Cardiopatía cianótica.

Respuesta correcta: 1. Carcinoma pulmonar.